¿Qué son las partículas beta:
1. Electrones emitidos por la corteza electrónica del elemento emisor.
2. Electrones emitidos por el núcleo del elemento emisor.
3. Iones positivos.
4. Protones.

Respuesta correcta: 2. Electrones emitidos por el núcleo del elemento emisor.